Clinical trial exclusion criterion:
Severe cognitive decline

Entity relations:
- Has_qualifier("cognitive decline", "Severe")